Clinical trial exclusion criterion:
Concurrent malignancy (if in remission, at least 5 years disease free) except for localized (in-situ) disease, basal carcinomas and cutaneous squamous cell carcinomas that have been adequately treated

Annotated entities:
- Condition: "malignancy"
- Temporal: "Concurrent"
- Value: "at least 5 years"
- Qualifier: "disease free"
- Qualifier: "in remission"
- Condition: "localized (in-situ) disease"
- Condition: "basal carcinomas"
- Condition: "cutaneous squamous cell carcinomas"
- Qualifier: "adequately treated"
- Negation: "except for"